Clinical trial inclusion criterion:
Female patient who is = 18yrs, and = 65yrs.

Entity relations:
- Has_value("Female", "= 18yrs")
- Has_value("Female", "= 65yrs")